abstinent from any tobacco/nicotine use for 4 hours prior to imaging

The above is a clinical trial inclusion criterion. Annotated with entity spans:
[Condition: abstinent] from any [Drug: tobacco]/[Drug: nicotine] use [Temporal: for 4 hours prior to imaging]